ASA 3+

The above is a clinical trial exclusion criterion. Annotated with entity spans:
[Condition: ASA 3+]